El test de matrices progresivas de Raven proporciona una estimación del:
1. Nivel de desarrollo.
2. Nivel de maduración.
3. Factor General de Inteligencia (Factor G).
4. Nivel de inteligencia verbal.
5. Nivel de inteligencia manipulativa.

Respuesta correcta: 3. Factor General de Inteligencia (Factor G).